Clinical trial exclusion criterion:
Is a recipient of a prophylactic or therapeutic HIV vaccine candidate at any time, or a recipient of other experimental vaccine(s) within the last 12 months. For participants who received an experimental vaccine (except HIV vaccine) more than 12 months ago, documentation of the identity of the experimental vaccine must be provided to the sponsor, who will determine eligibility on a case-by-case basis

Entity relations:
- Has_qualifier("HIV vaccine candidate", "prophylactic")
- Has_temporal("HIV vaccine candidate", "at any time")
- Has_temporal("other experimental vaccine(s)", "within the last 12 months")
- Has_negation("HIV vaccine", "except")
- AND("experimental vaccine", "HIV vaccine")
- Has_temporal("experimental vaccine", "more than 12 months ago")
- OR("prophylactic", "therapeutic")
- OR("HIV vaccine candidate", "other experimental vaccine(s)")